Clinical trial exclusion criterion:
Patients who have had a prior abdominal myomectomy

Entity relations:
- Has_temporal("abdominal myomectomy", "prior")